Age : 18-65

The above is a clinical trial inclusion criterion. Annotated with entity spans:
[Person: Age] : [Value: 18-65]